Clinical trial inclusion criterion:
FEV1 30 - 79% of predicted and FEV1/FVC < 70% (GOLD 2-3)

Annotated entities:
- Measurement: "FEV1"
- Value: "30 - 79% of predicted"
- Measurement: "FEV1/FVC"
- Value: "< 70%"
- Measurement: "GOLD"
- Value: "2-3"